Clinical trial inclusion criterion:
Patient is participating in an investigational drug or device clinical trial that has not reached its primary endpoint

Annotated entities:
- Non-query-able: "Patient is participating in an investigational drug or device clinical trial that has not reached its primary endpoint"